Clinical trial exclusion criteria:
PGD patients
More than 4 previous embryo transfers

Annotated entities:
- Procedure: "PGD"
- Multiplier: "More than 4"
- Temporal: "previous"
- Procedure: "embryo transfers"